Patients undergoing ambulatory hand surgery for carpal tunnel and trigger finger, under local anesthesia with or without sedation.

The above is a clinical trial inclusion criterion. Annotated with entity spans:
Patients undergoing [Qualifier: ambulatory] [Procedure: hand surgery] for [Condition: carpal tunnel] and [Condition: trigger finger], under [Procedure: local anesthesia] with or without sedation.